Previous treated with anti-diabetic medication

The above is a clinical trial exclusion criterion. Annotated with entity spans:
[Temporal: Previous] [Procedure: treated] with [Drug: anti-diabetic medication]